Clinical trial inclusion criterion:
hypertension medications taken on morning of surgery (except diuretics)

Entity relations:
- Has_negation("diuretics", "except")
- Has_temporal("hypertension medications", "on morning of surgery")
- AND("hypertension medications", "diuretics")